14. Previous or current radiation therapy or likelihood to receive this therapy during study participation

The above is a clinical trial exclusion criterion. Annotated with entity spans:
[Parsing_Error: 14.] [Temporal: Previous] or [Temporal: current] [Procedure: radiation therapy] or [Non-query-able: likelihood to] receive this therapy during study participation